Clinical trial exclusion criterion:
Hypersensitivity or allergic reaction to regadenoson or adenosine

Annotated entities:
- Condition: "Hypersensitivity"
- Condition: "allergic"
- Drug: "regadenoson"
- Drug: "adenosine"